Clinical trial exclusion criterion:
Male or female < 18 and > 62 years of age

Entity relations:
- Has_value("age", "< 18 and > 62 years")
- OR("Male", "female")